reversible aetiology for agitation (e.g. hypotension, hypoxia, hypoglycaemia)

The above is a clinical trial exclusion criterion. Annotated with entity spans:
[Condition: reversible aetiology] for [Condition: agitation] (e.g. [Condition: hypotension], [Condition: hypoxia], [Condition: hypoglycaemia])